Patients with a known diagnosis e.g. upper gastrointestinal cancer

The above is a clinical trial exclusion criterion. Annotated with entity spans:
Patients with a [Condition: known diagnosis] e.g. [Condition: upper gastrointestinal cancer]